>/= 18 years old

The above is a clinical trial inclusion criterion. Annotated with entity spans:
[Value: >/= 18 years old]